A diferencia de los receptores de la inmunidad adaptativa, los de la inmunidad innata se caracterizan por:
1. Tener una distribución clonal.
2. Su mayor diversidad.
3. Ser idénticos en las células del mismo linaje.
4. Reconocer y reaccionar frente a moléculas propias.
5. Estar sólo en la superficie celular.

Respuesta correcta: 3. Ser idénticos en las células del mismo linaje.